Clinical trial inclusion criterion:
NA

Annotated entities:
- Non-query-able: "NA"